allergic history or contraindication for any drugs in trials;

The above is a clinical trial exclusion criterion. Annotated with entity spans:
[Condition: allergic] [Temporal: history] or [Condition: contraindication] for [Qualifier: any] [Drug: drugs in trials];